當氧分子與血紅素（hemoglobin）結合時，此時血基質（heme）中Fe2+上的兩個開放配位鍵（open coordination bonds）與下列何組物質結合？
A. 一水分子與一胺基酸的側鏈
B. 一氧分子與一胺基酸的側鏈
C. 一氧分子與一水分子
D. 兩個氧分子

正確答案：B. 一氧分子與一胺基酸的側鏈